La química de las sales de diazonio proporciona el método sintético principal para preparar fluoruros de arilo mediante un proceso llamado:
1. Reordenamiento de Claisen.
2. Reacción de Gabriel.
3. Reacción de diazotación.
4. Reacción de Sandmeyer.
5. Reacción de Schiemann.

Respuesta correcta: 5. Reacción de Schiemann.